Clinical trial inclusion criteria:
Informed consent must be obtained prior to any study procedure.
Age>18 years.
Subjects of STEMI who underwent primary PCI within the first 12 hours.

Annotated entities:
- Post-eligibility: "Informed consent must be obtained prior to any study procedure"
- Person: "Age"
- Value: ">18 years."
- Condition: "STEMI"
- Procedure: "primary PCI"
- Temporal: "within the first 12 hours."